下列何者在懷孕初期絕對不可口服使用？
A. isotretinoin
B. fluconazole
C. metformin
D. phenytoin

正確答案：A. isotretinoin